Clinical trial exclusion criterion:
Uncontrolled systemic hypertension;

Annotated entities:
- Qualifier: "Uncontrolled"
- Condition: "systemic hypertension"